Spinal stenosis

The above is a clinical trial inclusion criterion. Annotated with entity spans:
[Condition: Spinal stenosis]